有關抗癲癇藥物之使用原則，下列何者錯誤？
A. 藥物選擇依癲癇分類而定
B. 逐漸增量而非馬上給予最高劑量
C. 原則上使用兩種藥物優於單一藥物，避免發生抗藥性
D. 藥物在體內之代謝速率有個別差異

正確答案：C. 原則上使用兩種藥物優於單一藥物，避免發生抗藥性